Clinical trial inclusion criterion:
Has a contact lens spherical prescription between + 2.25 to - 8.00 (inclusive)

Annotated entities:
- Device: "contact lens"
- Value: "+ 2.25 to - 8.00 (inclusive)"
- Qualifier: "spherical"